下列有關膀胱受傷（bladder injury）之敘述，何者正確？①骨盆腔受傷（pelvic injury）之中有約 5～ 10%合併膀胱受傷 ②骨盆腔受傷合併的膀胱受傷大多是腹膜內類型（intraperitoneal type） ③膀胱受傷有約 10～29%合併尿道受傷（urethral injury） ④血尿（hematuria）是骨盆腔受傷後懷疑有膀胱受傷的重要徵象，要做膀胱攝影（cystography）
A. 僅①②③
B. 僅①②④
C. 僅①③④
D. 僅②③④

正確答案：C. 僅①③④